Age greater than or equal to 18 years and less than 80 years

The above is a clinical trial inclusion criterion. Annotated with entity spans:
[Person: Age] [Value: greater than or equal to 18 years and less than 80 years]